Clinical trial inclusion criterion:
pregnant women in 30 to 32 weeks of gestation, with positive HBsAg and HBeAg,serum viral load above 8log10 copies per mL

Annotated entities:
- Condition: "pregnant"
- Person: "women"
- Value: "30 to 32 weeks"
- Measurement: "gestation"
- Measurement: "HBsAg"
- Measurement: "HBeAg"
- Value: "positive"
- Measurement: "serum viral load"
- Value: "above 8log10 copies per mL"